Clinical trial exclusion criterion:
use of Insulin, SGLT2-inhibitor, sulfonylurea derivate or a glinide within past 3 months

Annotated entities:
- Drug: "Insulin"
- Drug: "SGLT2-inhibitor"
- Drug: "sulfonylurea derivate"
- Drug: "glinide"
- Temporal: "past 3 months"